Clinical trial exclusion criterion:
History of diarrhoea in 7 days prior to first dose of vaccine (defined as =3 unformed loose stools in 24 hours).

Entity relations:
- Has_index("in 7 days prior to first dose of vaccine", "first dose of vaccine")
- Has_value("unformed loose stools in 24 hours", "=3")
- Subsumes("diarrhoea", "unformed loose stools in 24 hours")
- Has_temporal("diarrhoea", "in 7 days prior to first dose of vaccine")
- Has_temporal("diarrhoea", "History")